Clinical trial exclusion criterion:
Any patient who has been previously randomized in the EvK Trial.

Entity relations:
- Has_temporal("randomized", "previously")